Clinical trial inclusion criterion:
Vestibular schwannoma advised to surgical treatment

Entity relations:
- Has_mood("surgical treatment", "advised")
- AND("Vestibular schwannoma", "surgical treatment")